Clinical trial inclusion criterion:
Ann Arbor stage II,III or IV

Annotated entities:
- Measurement: "Ann Arbor stage"
- Value: "II"
- Value: "III"
- Value: "IV"